Clinical trial inclusion criterion:
Stable motor recovery

Annotated entities:
- Observation: "motor recovery"
- Qualifier: "Stable"